What molecules are the multidrug transporter MDR3 targeting?

Multidrug-resistant P-glycoprotein 3 (MDR3) is a phospholipid translocator.